Clinical trial inclusion criterion:
Agreement to the trial protocol, including the randomized manner

Annotated entities:
- Observation: "Agreement to the trial protocol"
- Observation: "Agreement to the randomized manner"